根據 Glasgow 昏迷指數，若患者住院時，對任何刺激眼睛皆無睜眼，身體呈現角弓反張，且無任何語言反應，則其昏迷指數為幾分？
A. 2
B. 3
C. 4
D. 5

正確答案：C. 4